單親媽媽阿慧的小兒子瑞祺（4 歲）罹患遺傳性大腦白質硬化症（adrenoleukodystrophy，以下簡稱 ALD）癱瘓在床，由於數年前瑞祺的哥哥因罹患同樣疾病過世，故阿慧知悉此病除骨髓移植外，沒有其他治本療法，且即便移植成功，先前不可逆的病變也無法回復。  眼見愛子來日無多，阿慧決定攜子返家，以溫暖家居生活伴其度過生命中最後一段旅程，為控制疾病所帶來的疼痛與不適，瑞祺的主治醫師羅醫師提供一套自主式疼痛控制系統，教導阿慧使用方式及劑量，交談過程中，阿慧數次向羅醫師吐露以藥物協助兒子快速、平靜死亡的想法，羅醫師於是在解說當中，另悄悄透露麻醉藥劑致死劑量之多寡。 
 出院數日後，無法忍受再見到瑞祺痛苦難耐景象的阿慧，終於選擇為兒子施打致死劑量的麻醉藥，讓瑞祺永遠脫離 ALD 的折磨。 
 在上述的事例中，羅醫師的行為可能違反了那一項倫理原則？
A. 行善原則，因為他沒有將瑞祺轉介給專業的安寧療護人員，且讓阿慧孤單無依地作決定
B. 尊重自主原則，因為他沒有尊重瑞祺本人的意願
C. 正義原則，因為羅醫師的行為等於是間接殺人
D. 不傷害原則，因為生命至高無上，絕對不可以剝奪

正確答案：A. 行善原則，因為他沒有將瑞祺轉介給專業的安寧療護人員，且讓阿慧孤單無依地作決定